Clinical trial inclusion criterion:
Newborns weighing 1.5kg or more at birth

Entity relations:
- Has_value("weighing", "1.5kg or more")
- Has_temporal("weighing", "at birth")